新生兒加護病房的護士接到自稱是病人秀秀阿姨的電話，詢問秀秀的呼吸情況好些沒。此時護士的何種作法較恰當？
A. 電話中確認她是否為秀秀的阿姨
B. 問她是否得到秀秀父母的授權
C. 告訴她所詢問的事，並叫她下次不要再打電話來
D. 婉轉說明電話中無法告知病情

正確答案：D. 婉轉說明電話中無法告知病情